當患有高血壓的婦女懷孕時，下列那一項降壓藥物不適合使用？
A. α-methyldopa
B. labetalol
C. captopril
D. nifedipine

正確答案：C. captopril